Clinical trial inclusion criterion:
Provide written informed consent before beginning any study related activities

Annotated entities:
- Observation: "written informed consent"
- Temporal: "before beginning any study related activities"
- Reference_point: "any study related activities"